陳小姐被推進急診室，雙眼緊閉朝右側躺，推床推動一段距離，她就開始一陣嘔吐。請她睜開雙眼，只見眼球不停向右震顫，隨即她又閉上雙眼。下列何者是陳小姐症狀的最正確答案？
A. 昏眩（dizziness）
B. 眩暈（vertigo）
C. 腸胃疾患
D. 眼球疾病

正確答案：B. 眩暈（vertigo）